Clinical trial exclusion criterion:
Hyper sensibility to sirolimus formula;

Annotated entities:
- Condition: "Hyper sensibility"
- Drug: "sirolimus"